下列那一項不是Apgar score的評估項目？
A. 心跳次數
B. 肌肉張力
C. 呼吸
D. 哭聲大小

正確答案：D. 哭聲大小